下列何者主要是由骨骼肌細胞的細胞膜（plasma membrane）所組成？
A. 肌纖維膜（sarcolemma）
B. 肌外膜（epimysium）
C. 肌內膜（endomysium）
D. 肌束膜（perimysium）

正確答案：A. 肌纖維膜（sarcolemma）